Cuando una persona trata de evitar las circunstancias que aumentan su estrés, hace ejercicios de relajación, planifica actividades de ocio y trivializa su enfermedad, se dice que esta persona está utilizando estrategias de afrontamiento dirigidas a:
1. La acción.
2. El problema.
3. La omisión.
4. La emoción.
5. La atención.

Respuesta correcta: 4. La emoción.